下列那一種細胞激素會抑制 Th1？
A. IFN-γ
B. TNF-α
C. IL-10
D. IL-12

正確答案：C. IL-10